Clinical trial inclusion criterion:
Has a spectacle cylinder up to 0.75D in each eye.

Entity relations:
- Has_value("spectacle cylinder", "up to 0.75D")